FibroScan within 12 months demonstrating liver stiffness of =9.5 kilo Pascal or

The above is a clinical trial exclusion criterion. Annotated with entity spans:
[Procedure: FibroScan] [Temporal: within 12 months] demonstrating [Measurement: liver stiffness] of [Value: =9.5 kilo Pascal] or